Clinical trial exclusion criterion:
Preoperative radio- or chemotherapy;

Annotated entities:
- Procedure: "chemotherapy"
- Procedure: "therapy radio"
- Temporal: "Preoperative"